Indique cuál de las siguientes es una enfermedad mitocondrial:
1. α-talasemia
2. Fructosuria esencial.
3. Síndrome de Leigh.
4. Síndrome de Cushing.
5. Anemia falciforme.

Respuesta correcta: 3. Síndrome de Leigh.